Clinical trial exclusion criterion:
With evidence of intrinsic sphincter deficiency as defined by a maximal urethral closure pressure of <20 cm H2O

Entity relations:
- Has_value("maximal urethral closure pressure", "<20 cm H2O")
- AND("intrinsic sphincter deficiency", "maximal urethral closure pressure")